Clinical trial inclusion criterion:
Approved clinical indication for pectoral pacemaker exchange (e.g. elective replacement indication (ERI), end of service (EOS))

Annotated entities:
- Condition: "elective replacement indication (ERI)"
- Condition: "end of service (EOS)"
- Condition: "clinical indication"
- Procedure: "pectoral pacemaker exchange"